Clinical trial inclusion criteria:
Male or female between, and including, 6-12 weeks (42 to 90 days) of age at the time of the first vaccination.
Subjects for whom the investigator believes that their parents/guardians can and will comply with the requirements of the protocol
Written informed consent obtained from the parent or guardian of the subject.
Free of obvious health problems as established by medical history and clinical examination before entering into the study.
Born after a gestation period between 36 and 42 weeks.

Annotated entities:
- Value: "between 6-12 weeks"
- Value: "between 42 to 90 days"
- Person: "of age"
- Temporal: "at the time of the first vaccination"
- Non-query-able: "Subjects for whom the investigator believes that their parents/guardians can and will comply with the requirements of the protocol"
- Observation: "Written informed consent"
- Qualifier: "parent"
- Qualifier: "guardian"
- Condition: "health problems"
- Qualifier: "obvious"
- Negation: "Free"
- Value: "between 36 and 42 weeks"
- Measurement: "gestation period"
- Condition: "Born"